Clinical trial inclusion criterion:
Subjects undergoing treatment for type 2 diabetes

Annotated entities:
- Condition: "type 2 diabetes"
- Procedure: "treatment"